Clinical trial inclusion criterion:
Diagnosis of DSM 5 Anxiety Disorder

Annotated entities:
- Condition: "DSM 5 Anxiety Disorder"